Clinical trial exclusion criterion:
wish for pregnancy within next three months

Entity relations:
- Has_mood("pregnancy", "wish for")
- Has_temporal("pregnancy", "within next three months")